La principal indicación para utilizar 4 fármacos en el tratamiento inicial de la tuberculosis es:
1. Afectación del sistema nervioso central.
2. Alta prevalencia de resistencia primaria a isoniacida.
3. Tuberculosis pulmonar cavitada y extensa con gran carga bacilar.
4. Tuberculosis diseminada asociada a la infección por VIH.
5. Tuberculosis         extrapulmonar       en inmunodeprimidos de cualquier origen.

Respuesta correcta: 2. Alta prevalencia de resistencia primaria a isoniacida.